Have diagnosis of prostate cancer and have received treatment with GnRH agonist or antagonist therapy for at least 1 month prior to enrollment.

The above is a clinical trial inclusion criterion. Annotated with entity spans:
Have diagnosis of [Condition: prostate cancer] and have received [Procedure: treatment] with [Drug: GnRH agonist] or antagonist therapy [Multiplier: for at least 1 month] [Temporal: prior to enrollment].